Which is the function of the PRDM9 protein in mammals?

meiotic recombination